Clinical trial exclusion criterion:
Diagnosis of chronic pain currently taking opioid pain medication or with a history of drug abuse.

Entity relations:
- Has_temporal("drug abuse", "history of")
- AND("chronic pain", "opioid pain medication")
- OR("chronic pain", "drug abuse")